下列那一項檢查於偵測肺結節（pulmonary nodule）最敏感？
A. 磁振造影
B. 電腦斷層掃描
C. 超音波掃描
D. 普通 X 光素片

正確答案：B. 電腦斷層掃描